Clinical trial inclusion criterion:
Person is willing and able to independently provide informed consent.

Annotated entities:
- Informed_consent: "Person is willing and able to independently provide informed consent"